下列有關感覺受器（sensory receptor）之適應現象（adaptation）的敘述，何者正確？
A. 媒介 slow pain 的 nociceptor 屬於 slowly adapting receptors
B. Pacinian corpuscle 屬於 slowly adapting receptors
C. Golgi tendon apparatuses 屬於 rapidly adapting receptors
D. muscle spindle 屬於 rapidly adapting receptors

正確答案：A. 媒介 slow pain 的 nociceptor 屬於 slowly adapting receptors